Which major signaling pathways are regulated by RIP1?

necroptosis
apoptosis  
pro-survival/inflammation NF-κB activation